Clinical trial exclusion criterion:
Participation in clinical trials or undergoing other investigational procedures within 30 days prior to Day 1

Entity relations:
- multi("within 30 days prior to Day 1", "prior to Day 1")
- Has_temporal("Participation in clinical trials", "within 30 days prior to Day 1")
- OR("Participation in clinical trials", "undergoing other investigational procedures")